have undergone oro-tracheal intubation for a coma (Glasgow Coma Score below or equal to 8),

The above is a clinical trial inclusion criterion. Annotated with entity spans:
have undergone [Procedure: oro-tracheal intubation] for a [Condition: coma] ([Measurement: Glasgow Coma Score] [Value: below or equal to 8)],